Clinical trial inclusion criterion:
Cardiovascular disease

Annotated entities:
- Condition: "Cardiovascular disease"